Clinical trial inclusion criterion:
Lipid-rich plaque on NIRS(Intracoronary Near-Infrared Spectroscopy) (defined as maxLCBI4mm>315)

Annotated entities:
- Condition: "Lipid-rich plaque"
- Procedure: "NIRS"
- Procedure: "Intracoronary Near-Infrared Spectroscopy"
- Measurement: "maxLCBI4mm"
- Value: ">315"